Adult patients

The above is a clinical trial inclusion criterion. Annotated with entity spans:
[Person: Adult] patients